下列有關 Bacillus cereus 的敘述，何者錯誤？
A. 需要特殊培養基，細菌在低溫培養效果較好（cold enrichment）
B. 具有 heat-stable proteolysis-resistant enterotoxin 會引起嘔吐
C. 具有 heat-labile enterotoxin 會引起腹瀉
D. 在宿主體內形成 capsule 的菌株可造成肺炎

正確答案：A. 需要特殊培養基，細菌在低溫培養效果較好（cold enrichment）